Clinical trial exclusion criterion:
Platelet count <100,000/mm3

Entity relations:
- Has_value("Platelet count", "<100,000/mm3")